藉由抑制破骨細胞（osteoclast cell）的活化，可以改善骨質流失的藥物為何？
A. Infliximab（anti-TNF-α）
B. Denosumab（anti-RANK-L）
C. Daclizumab（anti-IL-2R）
D. Belimumab（anti-BLyS）

正確答案：B. Denosumab（anti-RANK-L）